Clinical trial exclusion criterion:
Hormone replacement therapy

Annotated entities:
- Procedure: "Hormone replacement therapy"